Clinical trial exclusion criterion:
If smoking and/or other drug addiction is present

Entity relations:
- OR("smoking", "drug addiction")